Clinical trial inclusion criterion:
2. Visual analog scale more than or equal to 4

Entity relations:
- Has_value("Visual analog scale", "more than or equal to 4")